Clinical trial inclusion criterion:
Female patients must have a negative serum pregnancy test at screening. (Not applicable to patients with bilateral oophorectomy and/or hysterectomy or to those patients who are postmenopausal.)

Entity relations:
- Has_value("serum pregnancy test", "negative")
- Has_temporal("serum pregnancy test", "at screening")
- AND("Female", "serum pregnancy test")
- AND("negative", "serum pregnancy test")
- AND("negative", "at screening")
- OR("bilateral oophorectomy", "hysterectomy", "postmenopausal")
- OR("negative", "bilateral oophorectomy")